Señalar el metabolito de la esteroidogénesis suprarrenal de mayor utilidad en el diagnóstico de déficit tardío de 21-hidroxilasa:
1. Pregnenolona.
2. 17-OH-pregnenolona.
3. 17-OH-progesterona.
4. Dehidroepiandrosterona (DHEA).

Respuesta correcta: 3. 17-OH-progesterona.